Patient with severe proctitis (MAYO score ≥ 11 at inclusion).

The above is a clinical trial exclusion criterion. Annotated with entity spans:
Patient with [Qualifier: severe] [Condition: proctitis] ([Measurement: MAYO score] [Value: ≥ 11] [Temporal: at inclusion]).